hypertrophic cardiomyopathy

The above is a clinical trial exclusion criterion. Annotated with entity spans:
[Condition: hypertrophic cardiomyopathy]